Clinical trial exclusion criterion:
Disseminated intravascular coagulation

Annotated entities:
- Condition: "Disseminated intravascular coagulation"